Clinical trial exclusion criterion:
Immunosuppressant therapy

Annotated entities:
- Procedure: "Immunosuppressant therapy"